56歲男性病患罹肺結核，於胸腔科門診治療一段時間後，發燒仍然持續，由於胸腔科醫師懷疑病患是否同時感染人類免疫缺乏病毒（HIV），經病患同意後抽血檢查，發現病患感染 HIV。檢查結果出來後，胸腔科醫師還沒有機會告訴病患該檢查結果，病患又因為發燒來到急診部。急診醫師基於好意，在發現病患感染HIV後，便將病患感染HIV的情況，在沒有告知病患的情況下，直接告知其妻子。下列敘述何者錯誤？
A. 感染HIV為法定傳染病，急診醫師有義務應該進行通報，同時也有義務將其HIV檢	結果告知其妻子，以保障其安全，無需病患同意
B. 急診醫師應該先將HIV檢	結果告知病患，並告知應該將檢	結果告知其妻子，在徵求其
C. 如果病患反對將檢	結果告知其妻子，急診醫師應該在通報後，由衛生單位進行個案追蹤，同時將檢	結果告知可能與病患有危險性行為之相關當事人
D. 如果病患得知自己為HIV感染者，而隱瞞與其太太進行危險性行為時，致傳染於其妻子，將有刑法上的責任

正確答案：A. 感染HIV為法定傳染病，急診醫師有義務應該進行通報，同時也有義務將其HIV檢	結果告知其妻子，以保障其安全，無需病患同意